Clinical trial exclusion criterion:
Coexisting causes of chronic liver disease - chronic viral hepatitis(B & C), autoimmune liver disease, hemochromatosis, Wilson's etc.

Annotated entities:
- Condition: "chronic liver disease"
- Condition: "chronic viral hepatitis B"
- Condition: "chronic viral hepatitis C"
- Parsing_Error: "&"
- Condition: "autoimmune liver disease"
- Condition: "hemochromatosis"
- Condition: "Wilson's"